Clinical trial exclusion criterion:
Intention to become pregnant during the course of the study

Annotated entities:
- Pregnancy_considerations: "Intention to become pregnant during the course of the study"